Clinical trial inclusion criterion:
9. Prior therapy with FLT3 inhibitors is permitted, except previous treatment with AC220.

Annotated entities:
- Drug: "FLT3 inhibitors"
- Mood: "permitted"
- Procedure: "therapy"
- Procedure: "treatment"
- Drug: "AC220"
- Negation: "except"